威而剛（Viagra）可透過加強一氧化氮（NO）下游 cGMP 的訊息傳遞作用，而達到其藥理效果。NO 是那一種胺基酸的代謝產物？
A. arginine
B. aspartate
C. lysine
D. tryptophan

正確答案：A. arginine